車禍大量失血時，於事發後的一小時，體內會藉由那些機制來維持血壓之恆定？①感壓反射（baroreflex） ②腎臟－血液容積壓力之調控（renal-blood volume pressure control） ③腎素－血管張力素－血管收縮作用（renin-angiotensinvasoconstriction） ④體液回收至微血管（capillary fluid shift）
A. ①②④
B. ①②③
C. ①③④
D. ②③④

正確答案：C. ①③④